Clinical trial inclusion criterion:
the patients undergoing ascending, arch and/or proximal descending aorta surgery with cardiopulmonary bypass

Entity relations:
- OR("ascending aorta surgery", "arch aorta surgery", "proximal descending aorta surgery")